Hemoglobin < 9 g/dL.

The above is a clinical trial exclusion criterion. Annotated with entity spans:
[Measurement: Hemoglobin] [Value: < 9 g/dL].